Tienen simetría helicoidal en su cápside los:
1. Virus de la rabia.
2. Virus del resfriado común.
3. Papilomavirus.
4. Herpesvirus.
5. Adenovirus.

Respuesta correcta: 1. Virus de la rabia.